Clinical trial exclusion criterion:
Positive serology for HBsAg, HCV or HIV antibodies

Entity relations:
- Has_value("HBsAg antibodies", "Positive")
- OR("HBsAg antibodies", "HCV antibodies", "HIV antibodies")